Subjects must be capable of providing signed and dated written informed consent by date of Visit 0 (-2 week).

The above is a clinical trial inclusion criterion. Annotated with entity spans:
[Informed_consent: Subjects must be capable of providing signed and dated written informed consent by date of Visit 0 (-2 week).]